一位 60 歲女性，體重 80 公斤有糖尿病及高血壓的病史，因陰道不正常出血到婦科門診求診，檢查發現子宮內膜有不規則增生的現象厚度達 2 公分，並侵犯子宮肌肉層。下列敘述何者錯誤？
A. 長期使用雌激素會增加罹患此種腫瘤的機率
B. 與 PTEN gene 有關
C. 若為 papillary serous type 則預後比較好
D. 依腺體分化程度分為 3 個等級且與預後有關

正確答案：C. 若為 papillary serous type 則預後比較好